Clinical trial inclusion criterion:
Non-smoking, or smoking no more than 10 cigarettes, or 2 cigars, or 2 pipes per day for at least 3 months prior to selection

Annotated entities:
- Condition: "smoking"
- Negation: "Non"
- Condition: "smoking"
- Multiplier: "no more than 10 per day"
- Observation: "cigarettes"
- Observation: "cigars"
- Multiplier: "no more than 2 per day"
- Multiplier: "no more than 2 per day"
- Observation: "pipes"
- Temporal: "for at least 3 months prior to selection"
- Reference_point: "selection"